Re-transplant;

The above is a clinical trial exclusion criterion. Annotated with entity spans:
[Procedure: Re-transplant];